Epileptic seizures that are not adequately controlled by Treatment

The above is a clinical trial exclusion criterion. Annotated with entity spans:
[Condition: Epileptic seizures] that are [Negation: not] [Qualifier: adequately controlled] by Treatment